Clinical trial exclusion criterion:
Any history of receiving GLP-1 analogues or dipeptidyl peptidase inhibitors within 6 months

Entity relations:
- Has_temporal("GLP-1 analogues", "within 6 months")
- OR("GLP-1 analogues", "dipeptidyl peptidase inhibitors")